Clinical trial inclusion criterion:
patients receiving home parenteral nutrition (HPN) because of short bowel syndrome for at least 12 months

Entity relations:
- Has_temporal("home parenteral nutrition (HPN)", "for at least 12 months")
- OR("home parenteral nutrition (HPN)", "short bowel syndrome")